Clinical trial inclusion criterion:
Informed consent explained to, understood by and signed by patient/guardian. Patient/guardian given copy of informed consent.

Annotated entities:
- Post-eligibility: "Informed consent explained to, understood by and signed by patient/guardian. Patient/guardian given copy of informed consent."